一位56歲婦女主訴兩側手指關節及膝關節疼痛已3個月，且兩眼乾澀，也常口渴喝水，最近2星期右側腮腺突然腫脹，下列那一項檢	最不會出現陽性結果？
A. rheumatoid factors
B. antinuclear antibodies
C. anti-SS-A（Ro）/SS-B（La）antibodies
D. anticardiolipin IgG and IgM

正確答案：D. anticardiolipin IgG and IgM